45 歲女性接受屍腎移植，總缺血時間（Total ischemic time）為十二小時三十五分，手術過程順利，術後使用抗淋巴球免疫球蛋白（antilymphocyte globulin）及類固醇為抗排斥藥物。術後前二天平均尿量為每小時 25 c.c.。病患的生命徵象穩定，中心靜脈壓在 10-12 cmH2O，術後超音波 Color Doppler  Ultrasound 顯示吻合血管流量正常，則有關術後排尿減少的現象，下列何者正確？
A. 一定是急性排斥現象
B. 應調高抗排斥藥物劑量
C. 腎功能不可能恢復，應立即手術切除移植腎
D. 可能是急性腎小管壞死現象

正確答案：D. 可能是急性腎小管壞死現象